¿Cómo se denomina la capa pigmentada y muy vascularizada de la pared posterior del globo ocular?
1. Iris.
2. Coroides.
3. Cuerpo ciliar.
4. Esclerótica.
5. Retina.

Respuesta correcta: 2. Coroides.